下列關於訊息傳遞的敘述，何者錯誤？
A. β-adrenergic receptor 是經由 cyclic AMP 進行細胞訊息傳遞
B. 一氧化氮（nitric oxide）是經由膜型 guanylyl cyclase 受體（membrane form guanylyl cyclase）進行細胞訊息傳遞
C. 細胞內鈣離子濃度受 inositol-3-phosphate（IP3）調控
D. cyclic AMP（cAMP）是藉由 allosteric regulation 的方式調控蛋白激 A（protein kinase A）活性

正確答案：B. 一氧化氮（nitric oxide）是經由膜型 guanylyl cyclase 受體（membrane form guanylyl cyclase）進行細胞訊息傳遞